Las proteínas transmembrana que se unen a proteínas intracelulares y extracelulares son:
1. Ocludinas.
2. Cadherinas.
3. Actinas.
4. Integrinas.
5. Desmocolinas.

Respuesta correcta: 4. Integrinas.